下列何種檢驗方式最能正確地測量腎絲球過濾率（glomerular filtration rate）？
A. 血中尿素氮值（blood urea nitrogen; BUN）
B. 血清肌酐酸值（serum creatinine concentration）
C. 肌酐酸廓清率（creatinine clearance rate; CCr）
D. 菊糖廓清率（inulin clearance rate; ICr）

正確答案：D. 菊糖廓清率（inulin clearance rate; ICr）